Presence of any Axis I psychiatric disorder (other than unipolar major depression) or substance abuse;

The above is a clinical trial exclusion criterion. Annotated with entity spans:
Presence of any [Qualifier: Axis I] [Condition: psychiatric disorder] ([Negation: other than] [Condition: unipolar major depression]) or [Condition: substance abuse];